依照醫師法規定，下列那個國家不能以外國學歷直接參加醫師資格考試，應先經教育部學歷甄試通過，始得參加考試？
A. 香港
B. 日本
C. 南非
D. 中國大陸

正確答案：D. 中國大陸